Clinical trial exclusion criterion:
Accompanied with other severe disease (involve C.diff infection)

Annotated entities:
- Condition: "severe disease"
- Condition: "C.diff infection"